下列有關脊椎之敘述，何者錯誤？
A. 後縱韌帶（Posterior longitudinal ligament）位在椎管（vertebral canal）內
B. 棘突上韌帶（Supraspinous ligament）由第二頸椎棘突到薦椎
C. 環軸關節（Atlantoaxial joint）的主要動作是旋轉（rotation）
D. 脊柱可作屈（flexion）、伸（extension）及旋轉動作

正確答案：B. 棘突上韌帶（Supraspinous ligament）由第二頸椎棘突到薦椎